Viremia >= 3 log UI/ml

The above is a clinical trial inclusion criterion. Annotated with entity spans:
[Measurement: Viremia] [Value: >= 3 log UI/ml]